Clinical trial inclusion criterion:
Males aged 18 years and above

Entity relations:
- Has_value("aged", "18 years and above")